有關三聚體G蛋白質偶合受體（trimeric G protein-coupled receptor），不具下列何種特性？
A. 部分受體利用環狀核苷酸（cyclic nucleotides）作為訊息傳遞者
B. 是一種細胞核受體（nuclear receptor）
C. 此受體會與G蛋白質交互作用
D. 此受體具有許多穿膜結構

正確答案：B. 是一種細胞核受體（nuclear receptor）